Clinical trial inclusion criterion:
Men and women 18 years of age and older who are able to complete the neuropsychological tests

Annotated entities:
- Person: "women"
- Person: "Men"
- Value: "18 years and older"
- Person: "age"
- Observation: "able to complete"
- Procedure: "neuropsychological tests"